Phase I: Patients must have histologically confirmed R/R NHL or HL (defined by WHO criteria). Patients with chronic lymphocytic leukemia (CLL) and small lymphocytic lymphoma (SLL) are eligible. In addition, patients with NHL other than diffuse large B cell lymphomas (DLBCL) must have received at least 2 prior therapies. Patients with DLBCL and HL will be eligible if there is no available standard therapy.

The above is a clinical trial inclusion criterion. Annotated with entity spans:
Phase I: Patients must have [Procedure: histologically] [Value: confirmed] [Qualifier: R/R] [Condition: NHL] or [Condition: HL] (defined by [Measurement: WHO criteria]). Patients with [Procedure: chronic lymphocytic leukemia (CLL)] [Grammar_Error: and] [Procedure: small lymphocytic lymphoma (SLL)] are eligible. In addition, patients with [Condition: NHL] [Negation: other than] [Condition: diffuse large B cell lymphomas (DLBCL)] must have received [Multiplier: at least 2] [Temporal: prior] [Procedure: therapies]. Patients with [Condition: DLBCL] [Grammar_Error: and] [Condition: HL] will be eligible if there is [Negation: no] available [Procedure: standard therapy].